若執行一個衛生計畫中，擬評估「民眾參與率是否達到預期值？」「資源運用是否理想？」「執行者的投入是否符合角色？」等問題，是屬於那一種評價工作？
A. 過程評價
B. 結果評價
C. 衝擊評價
D. 形式評價

正確答案：A. 過程評價